胃的黏膜層（mucosa）沒有下列何種細胞？
A. 表面黏液細胞（surface mucous cell）
B. 杯狀細胞（goblet cell）
C. 壁細胞（parietal cell）
D. 未分化的成體幹細胞（undifferentiated adult stem cell）

正確答案：B. 杯狀細胞（goblet cell）